Clinical trial inclusion criterion:
Performed spirometry at Visit 1 and Visit 2 and willing to perform spirometry at Visit 3

Entity relations:
- Has_temporal("spirometry", "at Visit 1")
- Has_temporal("spirometry", "at Visit 3")
- Has_mood("spirometry", "willing to perform")
- Has_index("at Visit 1", "Visit 1")
- Has_index("at Visit 2", "Visit 2")
- Has_index("at Visit 3", "Visit 3")
- Has_temporal("spirometry", "at Visit 2")